Clinical trial exclusion criterion:
Meet one or more of the contraindications for MRI including Psychiatric disorders, anxiety, claustrophobia Cardiac disorders that represent a contraindication to MRI

Entity relations:
- AND("contraindication", "MRI")
- AND("Cardiac disorders", "contraindication")
- AND("contraindications", "MRI")
- Has_multiplier("contraindications", "one or more")
- Subsumes("contraindications", "Psychiatric disorders")
- OR("Psychiatric disorders", "claustrophobia", "anxiety", "Cardiac disorders")